What is ectopia lentis?

Ectopia Lentis is dislocation of the optic lens in the eye.